Which type of lung cancer is the most strongly associated with Lambert-Eaton syndrome?

Small-cell lung cancer is most commonly associated with Lambert-Eaton syndrome. Case reports suggest that other non-small-cell lung cancer types, such as large-cell neuroendocrine carcinoma and squamous cell carcinoma,  can be also very rarely associated this syndrome.